latex allergy

The above is a clinical trial exclusion criterion. Annotated with entity spans:
[Drug: latex] [Condition: allergy]